Clinical trial inclusion criterion:
ability to use verbal or pictorial pain assessment tools and techniques

Annotated entities:
- Condition: "ability"
- Procedure: "pictorial pain assessment tools and techniques"
- Procedure: "verbal pain assessment tools and techniques"